2. Were taking a lidocaine-containing product that could not be discontinued while receiving lidocaine

The above is a clinical trial exclusion criterion. Annotated with entity spans:
2. Were taking a [Drug: lidocaine-containing product] that [Qualifier: could not be discontinued] [Temporal: while receiving lidocaine]